Clinical trial inclusion criterion:
Confirmation of glenohumeral OA via imaging

Annotated entities:
- Condition: "glenohumeral OA"
- Procedure: "imaging"